Clinical trial exclusion criterion:
Hepatic dysfunction defined as serum AST and/or ALT> 3 times upper limit of normal (approximately 120 IU/L however, will vary depending on age),

Entity relations:
- Has_value("serum AST", "> 3 times upper limit of normal")
- Subsumes("> 3 times upper limit of normal", "approximately 120 IU/L")
- Subsumes("Hepatic dysfunction", "serum AST")
- OR("serum AST", "serum ALT")